Clinical trial inclusion criterion:
patient 18 years old and more

Annotated entities:
- Person: "old"
- Value: "and more 18 years"